Clinical trial inclusion criterion:
American Society of Anesthesiologists risk classification I and II

Annotated entities:
- Measurement: "American Society of Anesthesiologists risk classification"
- Value: "I and II"